Good general health ascertained by medical history, physical examination and laboratory determinations, showing no signs of clinically significant findings, except chronic atopic dermatitis

The above is a clinical trial inclusion criterion. Annotated with entity spans:
[Condition: Good general health] [Qualifier: ascertained by medical history, physical examination and laboratory determinations], showing [Negation: no] [Observation: signs of clinically significant findings], [Negation: except] [Condition: chronic atopic dermatitis]